62歲商人出差到國外，因水土不服腹瀉很厲害，到當地醫院就醫，醫師診斷他是感染性腹瀉而且有	血症的現象，下列那一種細菌最有可能造成此病況？
A. Campylobacter species
B. Salmonella species
C. Yersinia enterocolitica
D. Aeromonas hydrophila

正確答案：B. Salmonella species